Males and females 21 years of age or older;

The above is a clinical trial inclusion criterion. Annotated with entity spans:
[Person: Males] and [Person: females] [Value: 21 years] of [Person: age] or older;